Active infection, e.g., deep-tissue infection, that the Investigator considers sufficiently serious to preclude study participation

The above is a clinical trial exclusion criterion. Annotated with entity spans:
[Qualifier: Active] [Condition: infection], e.g., [Condition: deep-tissue infection], that the Investigator considers sufficiently serious to preclude study participation